Clinical trial inclusion criterion:
2. Be 18 55 years of age.

Annotated entities:
- Parsing_Error: "2."
- Person: "age"
- Value: "18 55 years"